Age: 18 to 65 years

The above is a clinical trial inclusion criterion. Annotated with entity spans:
[Person: Age]: [Value: 18 to 65 years]